¿Qué actitud debe mostrar el evaluador en la primera entrevista?
1. Debe comenzar utilizando preguntas cerradas.
2. Debe utilizar preguntas que vayan de lo particular a lo general.
3. Debe cuidar los aspectos verbales (intensidad, tono, etc.) para propiciar la comunicación.
4. No debe centrarse en el problema o problemas por el que se consulta.
5. Debe interrumpir al entrevistado y limitar sus interacciones.

Respuesta correcta: 3. Debe cuidar los aspectos verbales (intensidad, tono, etc.) para propiciar la comunicación.